Cardiopulmonary instability (including pulmonary edema, cardiac insufficiency, myocardial infarction, acidosis and hemodynamic instability requiring significant vasopressor support)

The above is a clinical trial exclusion criterion. Annotated with entity spans:
[Condition: Cardiopulmonary instability] (including [Condition: pulmonary edema], [Condition: cardiac insufficiency], [Condition: myocardial infarction], [Condition: acidosis] and [Condition: hemodynamic instability] requiring [Qualifier: significant] [Qualifier: vasopressor support])